Patients with sick sinus syndrome (SSS) or high degree AV block without pacemaker protection

The above is a clinical trial exclusion criterion. Annotated with entity spans:
Patients with [Condition: sick sinus syndrome] ([Condition: SSS]) or [Qualifier: high degree] [Condition: AV block] [Negation: without] [Procedure: pacemaker] protection